La enfermera identifica que la persona a la que ha valorado presenta una serie de manifestaciones que se corresponden con las características definitorias de una etiqueta diagnóstica, sin embargo, no identifica ninguna posible causa. ¿Cómo debe enunciar el diagnóstico siguiendo las directrices del formato PES?
1. Problema relacionado con causa desconocida manifestado por las características definitorias identificadas.
2. Utilizando el término relacionado con en lugar de debido a, entre problema y etiología.
3. Como un diagnóstico de riesgo.
4. Problema relacionado con las características definitorias identificadas.
5. La ausencia de causa significa que no existe problema, por lo que no podría enunciarse un diagnóstico.

Respuesta correcta: 1. Problema relacionado con causa desconocida manifestado por las características definitorias identificadas.